下列關於 steroid hormone response element（HRE）的敘述，何者正確？
A. 是一種 plasma membrane protein，可與 hormone 結合
B. 是一種 nuclear protein，可與 hormone 結合
C. 為一段 intron sequence，可與 activated hormone receptor 結合
D. 為一段 DNA sequence，可與 hormone-receptor complex 結合 50 	NADH 脫氫（NADH dehydrogenase）的輔為：

正確答案：D. 為一段 DNA sequence，可與 hormone-receptor complex 結合 50 	NADH 脫氫（NADH dehydrogenase）的輔為：